Clinical trial inclusion criterion:
Patients intubated within one hour prior to care transition to the CICU will also be screened for inclusion.

Entity relations:
- multi("care transition", "care transition")
- Has_index("within one hour prior to care transition", "care transition")
- Has_temporal("intubated", "within one hour prior to care transition")